Clinical trial exclusion criterion:
Other active inflammatory process (major infection, malignancy, rheumatoid arthritis/autoimmune disorder) within the prior 28 days.

Annotated entities:
- Condition: "active inflammatory process"
- Qualifier: "Other"
- Condition: "major infection"
- Condition: "malignancy"
- Condition: "rheumatoid arthritis"
- Condition: "autoimmune disorder"
- Temporal: "within the prior 28 days"